開心手術時，當體外循環的支持停止後，血液中的肝素（heparin），必須使用下列何種方式處理，使其活化凝血時間（activated clotting time）回復正常？
A. 血小板靜脈注射
B. 新鮮血漿靜脈注射
C. 魚精蛋白（protamine sulfate）靜脈注射
D. 冷沈澱物（cryoprecipitate）靜脈注射

正確答案：C. 魚精蛋白（protamine sulfate）靜脈注射